Clinical trial inclusion criterion:
Eligible for Mifeprex(r) at a study clinical site

Entity relations:
- Has_mood("Mifeprex(r)", "Eligible for")
- AND("Mifeprex(r)", "study clinical site")